Clinical trial exclusion criterion:
known allergies for tranexamic acid or any other substance in Exacyl

Entity relations:
- AND("allergies", "tranexamic acid")
- OR("tranexamic acid", "Exacyl")